Stable dose of NSAIDs including Cyclooxygenase-1 (COX-1) or Cyclooxygenase-2 (COX-2) inhibitors for at least 2 weeks before their Baseline Visit

The above is a clinical trial inclusion criterion. Annotated with entity spans:
Stable dose of [Drug: NSAIDs] including Cyclooxygenase-1 (COX-1) or [Drug: Cyclooxygenase-2 (COX-2) inhibitors] [Temporal: for at least 2 weeks before their Baseline Visit]